下列關於舌頭的敘述，何者錯誤？
A. 味蕾是位於舌頭上皮中的特化感覺器官
B. 絲狀乳頭（Filiform papillae）數量最多
C. 舌頭表面為複層鱗狀上皮所覆蓋
D. 舌頭肌肉為複合交錯的平滑肌纖維組成

正確答案：D. 舌頭肌肉為複合交錯的平滑肌纖維組成